Clinical trial exclusion criterion:
Subject with a history of myocardial infarction, stroke or life-threatening arrhythmia within 6 months prior to screening

Entity relations:
- Has_index("within 6 months prior to screening", "screening")
- Has_qualifier("arrhythmia", "life-threatening")
- Has_temporal("myocardial infarction", "within 6 months prior to screening")
- OR("myocardial infarction", "stroke", "arrhythmia")